有關病歷的記錄與修改，下列敘述何者錯誤？
A. 醫師應親自記載病歷或製作紀錄，簽名或蓋章及加註年月日
B. 病歷或紀錄如有增刪，應於增刪處簽名或蓋章及加註年月日
C. 病歷修改的部分，基於美觀及醫院評鑑的需要，可以修正帶或立可白	銷	毀
D. 配偶代為申請病歷，即便身分確認，仍應有委託書

正確答案：C. 病歷修改的部分，基於美觀及醫院評鑑的需要，可以修正帶或立可白	銷	毀